Clinical trial exclusion criteria:
Current wheeze
Underlying chronic illness other than asthma (e.g. bronchiectasis, cyanotic congenital heart disease or cardiac failure, neuromuscular disorders, immunodeficiency) that could potentially influence the current illness
Severe malnutrition (weight-for-height Z-score <-3)
Complicated (effusion, empyema or abscess) pneumonia, including tuberculosis
Extra-pulmonary infection requiring antibiotic therapy (e.g. meningitis)
Beta-lactam allergy
Previously enrolled
Lack a mobile phone and/or unable to return for follow-up clinic visits during the next 24 months

Annotated entities:
- Condition: "wheeze"
- Condition: "chronic illness"
- Negation: "other"
- Condition: "asthma"
- Condition: "bronchiectasis"
- Condition: "cyanotic congenital heart disease"
- Condition: "cardiac failure"
- Condition: "neuromuscular disorders"
- Condition: "immunodeficiency"
- Condition: "malnutrition"
- Qualifier: "Severe"
- Measurement: "weight-for-height Z-score"
- Value: "<-3"
- Condition: "Complicated pneumonia"
- Condition: "tuberculosis"
- Condition: "effusion"
- Condition: "empyema"
- Condition: "abscess"
- Qualifier: "Extra-pulmonary"
- Condition: "infection"
- Procedure: "antibiotic therapy"
- Condition: "meningitis"
- Condition: "allergy"
- Drug: "Beta-lactam"
- Competing_trial: "Previously enrolled"
- Post-eligibility: "Lack a mobile phone and/or unable to return for follow-up clinic visits during the next 24 months"